Clinical trial inclusion criterion:
Less than 24 hours since bite, AND

Entity relations:
- multi("bite", "bite")
- Has_index("Less than 24 hours since bite", "bite")